一位重症肌無力（myasthenia gravis）女性病人經開刀移除胸腺。下列何者為最少見的胸腺病理變化？
A. 正常胸腺
B. 胸腺瘤（thymoma）
C. 胸腺淋巴樣增生（thymic lymphoid hyperplasia）
D. 胸腺癌（thymic carcinoma）

正確答案：D. 胸腺癌（thymic carcinoma）